56歲男性皮膚及鞏膜泛黃，且有茶色尿及灰白便。下列敘述何者正確？
A. 此病人有溶血性黃疸
B. 若摸到腫大的膽囊，病人肝外膽管阻塞
C. 血中升高的膽紅素主要是非接合型膽紅素
D. 肝癌細胞因為會製造過多膽紅素也特別容易出現此類黃疸

正確答案：B. 若摸到腫大的膽囊，病人肝外膽管阻塞